下列那一種治療部分性癲癇（partial seizure）的藥物，常因為肝臟毒性的副作用，而減少其普遍使用性？
A. Diazepam
B. Felbamate
C. Ethosuximide
D. Valproic acid

正確答案：B. Felbamate